Clinical trial inclusion criteria:
1) histologically confirmed (patients not receiving a single sputum cytology diagnosis) non-small cell lung cancer patients,with wild-type EGFR and ALK-negative; 2) According to IASLC2009 new TNM staging of lung cancer stage <U+2162>B or <U+2163>, previously untreated or relapsed after 1 year of lung cancer resection; 3) have at least one evaluable lesions,according to version 1.1 of the standard in accordance with a judgment RECIST(longest diameter on a spiral CT at least 10mm,on a regular CT longest diameter at least 20mm); 4) Male or female, aged 18 to 75 years; 5) ECOG PS 0 or 1; 6) expected survival at least 3 months; 7) adequate hematological function: absolute neutrophil count (ANC) at least 2×10^9/L and platelet count at least 100×10^9/L and hemoglobin at least 9 g/dL; 8) adequate liver function: total bilirubin less than upper limit of normal (ULN); AST and ALT less than 2.5 times upper limit of normal (ULN); alkaline phosphatase less than 5 times the upper limit of normal (ULN); 9) adequate renal function: serum creatinine less than upper limit of normal (ULN) or calculated creatinine clearance at least 60 mL/min; 10) ECG is normal, there is no non-healing wounds on the body; 11) had not received previous treatment anticancer drugs, or had only received for previous non-metastatic tumors adjuvant or neoadjuvant chemotherapy, but when you start to study treatment has ended more than 6 months; 12) have conducted previous surgery patients required to study treatment was started more than four weeks, and the patient had recovered; 13) have an intact uterus in women prior to enrollment in the study must have a negative pregnancy test result (unless it is already 24 months of amenorrhea) within 28 days. If the pregnancy test from the first administration more than seven days, urine pregnancy test is required for authentication (less than 7 days before the first dose); 14) previous to biological agents, particularly E.coli genetically engineered products without serious allergic reactions; 15) signed informed consent.

Annotated entities:
- Qualifier: "histologically confirmed"
- Condition: "non-small cell lung cancer"
- Qualifier: "wild-type EGFR"
- Qualifier: "ALK-negative"
- Measurement: "IASLC2009 new TNM staging"
- Condition: "lung cancer"
- Value: "stage <U+2162>B or <U+2163>"
- Qualifier: "untreated"
- Qualifier: "relapsed"
- Temporal: "after 1 year of lung cancer resection"
- Reference_point: "lung cancer resection"
- Multiplier: "at least one"
- Condition: "evaluable lesions"
- Measurement: "longest diameter"
- Procedure: "spiral CT"
- Value: "at least 10mm"
- Procedure: "regular CT"
- Measurement: "longest diameter"
- Value: "at least 20mm"
- Person: "Male"
- Person: "female"
- Person: "aged"
- Value: "18 to 75 years"
- Measurement: "ECOG PS"
- Value: "0 or 1"
- Observation: "expected survival"
- Temporal: "at least 3 months"
- Condition: "adequate hematological function"
- Measurement: "absolute neutrophil count (ANC)"
- Value: "at least 2×10^9/L"
- Measurement: "platelet count"
- Value: "at least 100×10^9/L"
- Measurement: "hemoglobin"
- Value: "at least 9 g/dL"
- Condition: "adequate liver function"
- Measurement: "total bilirubin"
- Value: "less than upper limit of normal (ULN)"
- Measurement: "AST"
- Measurement: "ALT"
- Value: "less than 2.5 times upper limit of normal (ULN)"
- Measurement: "alkaline phosphatase"
- Value: "less than 5 times the upper limit of normal (ULN)"
- Condition: "adequate renal function"
- Measurement: "serum creatinine"
- Value: "less than upper limit of normal (ULN)"
- Measurement: "calculated creatinine clearance"
- Value: "at least 60 mL/min"
- Measurement: "ECG"
- Value: "normal"
- Negation: "no"
- Condition: "non-healing wounds on the body"
- Drug: "anticancer drugs"
- Negation: "not received"
- Condition: "non-metastatic tumors"
- Qualifier: "neoadjuvant"
- Qualifier: "adjuvant"
- Procedure: "chemotherapy"
- Temporal: "ended more than 6 months"
- Temporal: "previous"
- Non-representable: "have conducted previous surgery patients required to study treatment was started more than four weeks, and the patient had recovered"
- Pregnancy_considerations: "have an intact uterus in women prior to enrollment in the study must have a negative pregnancy test result (unless it is already 24 months of amenorrhea) within 28 days. If the pregnancy test from the first administration more than seven days, urine pregnancy test is required for authentication (less than 7 days before the first dose);"
- Non-query-able: "signed informed consent."
- Non-representable: "previous to biological agents, particularly E.coli genetically engineered products without serious allergic reactions;"
- Line: "15) signed informed consent."
- Line: "14) previous to biological agents, particularly E.coli genetically engineered products without serious allergic reactions;"
- Line: "have an intact uterus in women prior to enrollment in the study must have a negative pregnancy test result (unless it is already 24 months of amenorrhea) within 28 days. If the pregnancy test from the first administration more than seven days, urine pregnancy test is required for authentication (less than 7 days before the first dose);"
- Line: "12) have conducted previous surgery patients required to study treatment was started more than four weeks, and the patient had recovered;"
- Line: "11) had not received previous treatment anticancer drugs, or had only received for previous non-metastatic tumors adjuvant or neoadjuvant chemotherapy, but when you start to study treatment has ended more than 6 months"
- Line: "ECG is normal, there is no non-healing wounds on the body;"
- Line: "adequate renal function: serum creatinine less than upper limit of normal (ULN) or calculated creatinine clearance at least 60 mL/min;"
- Line: "adequate liver function: total bilirubin less than upper limit of normal (ULN); AST and ALT less than 2.5 times upper limit of normal (ULN); alkaline phosphatase less than 5 times the upper limit of normal (ULN)"
- Line: "adequate hematological function: absolute neutrophil count (ANC) at least 2×10^9/L and platelet count at least 100×10^9/L and hemoglobin at least 9 g/dL"
- Line: "expected survival at least 3 months;"
- Line: "Male or female, aged 18 to 75 years; 5) ECOG PS 0 or 1"
- Line: "have at least one evaluable lesions,according to version 1.1 of the standard in accordance with a judgment RECIST(longest diameter on a spiral CT at least 10mm,on a regular CT longest diameter at least 20mm)"
- Line: "According to IASLC2009 new TNM staging of lung cancer stage <U+2162>B or <U+2163>, previously untreated or relapsed after 1 year of lung cancer resection"
- Line: "histologically confirmed (patients not receiving a single sputum cytology diagnosis) non-small cell lung cancer patients,with wild-type EGFR and ALK-negative;"